Clinical trial exclusion criterion:
History of excessive alcohol use, drug abuse or significant psychiatric illness

Annotated entities:
- Temporal: "History"
- Condition: "excessive alcohol use"
- Condition: "drug abuse"
- Condition: "psychiatric illness"
- Undefined_semantics: "psychiatric illness"
- Qualifier: "significant"